Clinical trial exclusion criterion:
Preexisting systemic diseases or conditions that may confound the results of the study;

Entity relations:
- Has_temporal("systemic diseases", "Preexisting")
- Has_qualifier("conditions", "may confound the results of the study")
- OR("systemic diseases", "conditions")